Clinical trial exclusion criterion:
clinical suspicion that subject can not use PCA adequately

Annotated entities:
- Mood: "clinical suspicion"
- Observation: "subject can not use PCA adequately"